Patients with signed informed consent

The above is a clinical trial inclusion criterion. Annotated with entity spans:
[Non-query-able: Patients with signed informed consent]